a history of acute trauma

The above is a clinical trial exclusion criterion. Annotated with entity spans:
a [Temporal: history] of [Condition: acute trauma]